一位 39 歲女性，6 年前開始在冬天時手指會有蒼白及變紫（cyanosis）現象出現。近 1 年來會有兩手僵硬、酸麻及肌肉疼痛。近 2 個月來有乾咳發生。理學檢查發現兩側手指及手背的皮膚硬化及腫脹。 抽血檢查發現 ANA 1:640 nucleolar＋centromere pattern, IgG 2185 mg/mL, IgA 375 mg/mL, IgM 134 mg/mL, CK 65 U/L, C3 94 mg/dL, C4 21.5 mg/dL, anti-dsDNA<12 IU/mL, anti-RNP<7.0 IU/mL。這位患者最有可能的診斷是：
A. Mixed connective tissue disease
B. Chronic eczema
C. Systemic lupus erythematosus
D. Systemic sclerosis

正確答案：D. Systemic sclerosis